Advanced hormone-dependent prostate cancer without any other clinically significant disorder

The above is a clinical trial inclusion criterion. Annotated with entity spans:
[Qualifier: Advanced] [Qualifier: hormone-dependent] [Condition: prostate cancer] [Non-query-able: without any other clinically significant disorder]